Clinical trial inclusion criteria:
35-75 years old;
diagnosed as type 2 diabetes according to the criteria of the World Health Organization in 1999.

Annotated entities:
- Value: "35-75 years old"
- Person: "old"
- Condition: "type 2 diabetes"
- Qualifier: "criteria of the World Health Organization in 1999"